Previous cardiac surgery (including CABG) within the past 6 months (180 days)

The above is a clinical trial exclusion criterion. Annotated with entity spans:
[Temporal: Previous] [Procedure: cardiac surgery] (including [Procedure: CABG]) [Temporal: within the past 6 months (180 days)]